12 歲血紅素 H 症（hemoglobin H disease）患者，曾接受脾臟切除，最近有發高燒及咳嗽情形，考慮病人可能有敗血症（sepsis）狀況，下列那種病菌較不常見於此患者身上？
A. Streptococcus pneumoniae
B. Escherichia coli
C. Haemophilus influenzae
D. Neisseria meningitidis

正確答案：D. Neisseria meningitidis